Clinical trial inclusion criterion:
Less than or equal to (<=) 1 previous failed embryo transfer

Annotated entities:
- Value: "Less than or equal to (<=) 1"
- Measurement: "previous failed embryo transfer"